Clinical trial inclusion criterion:
nondiabetic patients

Entity relations:
- Has_negation("diabetic", "non")